current regular user of e-cigarettes (use at least once daily for the past 30 days) with nicotine strength > 6mg/ml

The above is a clinical trial inclusion criterion. Annotated with entity spans:
current [Qualifier: regular] [Person: user] of [Qualifier: e-cigarettes] (use [Multiplier: at least once daily] [Temporal: for the past 30 days]) with [Measurement: nicotine strength] [Value: > 6mg/ml]